Any suspicion or history of alcohol abuse and/or consumption of other drugs of abuse

The above is a clinical trial exclusion criterion. Annotated with entity spans:
Any [Observation: suspicion] or [Temporal: history] of [Condition: alcohol abuse] and/or [Condition: consumption of other drugs of abuse]